La presión alveolar supera a la atmosférica:
1. En la fase inicial de la inspiración.
2. En la fase media de la inspiración.
3. En la fase media de una espiración.
4. Al finalizar la espiración.
5. Al finalizar la inspiración.

Respuesta correcta: 3. En la fase media de una espiración.